Clinical trial inclusion criterion:
Psychiatric patients already diagnosed of schizophrenia or bipolar disorder, according to the Diagnostic and Statistical Manual of Mental Disorders- IV, Diagnostic and Statistical Manual of Mental Disorders- V or International Code of Disease criteria.

Entity relations:
- Subsumes("schizophrenia", "Diagnostic and Statistical Manual of Mental Disorders- IV")
- OR("schizophrenia", "bipolar disorder")
- OR("Diagnostic and Statistical Manual of Mental Disorders- IV", "Diagnostic and Statistical Manual of Mental Disorders- V", "International Code of Disease criteria")